有關護理之家工作同仁及住民之流行性感冒疫苗接種，下列敘述何者正確？
A. 護理之家工作同仁及住民接受流感疫苗接種不會影響流感暴發（outbreak）之危險
B. 流感疫苗對於老年人流感之保護率約為 60%
C. 行政院衛生署疾病管制局不建議於每年十一月前施打老人流感疫苗是要將保護期限延至隔年三月後
D. 施打流感疫苗沒有禁忌症（contraindication）

正確答案：B. 流感疫苗對於老年人流感之保護率約為 60%